Known or suspected HIV, Hepatitis B, or Hepatitis C infection

The above is a clinical trial exclusion criterion. Annotated with entity spans:
Known or suspected [Condition: HIV], [Condition: Hepatitis B], or [Condition: Hepatitis C infection]